四環黴素（tetracyclines）抑制細菌的機制是：
A. 抑制 transpeptidase，使細胞壁不能合成
B. 與 30S 核糖體結合，抑制蛋白質的合成
C. 使細胞膜通透性改變
D. 抑制 RNA 的合成

正確答案：B. 與 30S 核糖體結合，抑制蛋白質的合成